Clinical trial inclusion criterion:
7. Significant stenosis has been defined as a stenosis of more than 50% in luminal diameter (in at least one view, on visual interpretation or preferably by QCA);

Annotated entities:
- Measurement: "stenosis"
- Value: "more than 50% in luminal diameter"
- Condition: "Significant stenosis"